Clinical trial inclusion criterion:
FEV1 30 - 79% of predicted and FEV1/FVC < 70% (GOLD 2-3)

Entity relations:
- Has_value("FEV1", "30 - 79% of predicted")
- Has_value("GOLD", "2-3")
- Has_value("FEV1/FVC", "< 70%")
- Subsumes("FEV1/FVC", "GOLD")